How rare are CTCs (circulating tumour cells) in the plasma of patients?

CTCs are of extremely low number (as low as 1 in 10(9) hematologic cells) in the blood of patients.